Clinical trial exclusion criterion:
Other neoplastic disease in the 5 previous years, except squamous or basal cell skin carcinoma or cervical "in situ" carcinoma

Entity relations:
- Has_qualifier("neoplastic disease", "Other")
- Has_temporal("neoplastic disease", "in the 5 previous years")
- Has_negation("squamous cell skin carcinoma", "except")
- AND("neoplastic disease", "squamous cell skin carcinoma")
- OR("squamous cell skin carcinoma", "cervical "in situ" carcinoma", "basal cell skin carcinoma")